Clinical trial exclusion criterion:
Congenital or acquired immunodeficiency or ongoing therapy that cause immunosuppression

Annotated entities:
- Condition: "acquired immunodeficiency"
- Condition: "immunodeficiency Congenital"
- Procedure: "therapy that cause immunosuppression"
- Qualifier: "that cause immunosuppression"
- Condition: "immunosuppression"
- Temporal: "ongoing"